Clinical trial exclusion criterion:
(5)Known serious medical conditions, including: Cardiovascular: patients with clinically diagnosed cardiac dysfunction (NYHA class III and above), hypertrophic obstructive cardiomyopathy, clinically significant valvular heart disease, acute coronary syndrome within the last 3 months, or percutaneous coronary intervention (PCI), or coronary artery bypass graft (CABG); or abnormal pre-enrollment ECG test results with clinically significant arrhythmias (atrial flutter, atrial fibrillation, grade II-III atrioventricular block, etc.); Digestive: a previous diagnosis of various types of viral hepatitis that are still in the active phase; abnormal pre-enrollment liver function test results (ALT, AST, GGT, TBIL, or DBIL 3 times higher than normal, ALB = 30g/L); gastrectomy and/or gastrojejunostomy; gastrointestinal dysfunction; Urinary: pre-enrollment serum creatinine greater than 200umol/L; clinical diagnosis of renal artery stenosis, isolated kidney, kidney transplantation and/or other diseases; Endocrine: type 1 diabetes or uncontrolled type 2 diabetes (fasting blood glucose above 11.1 mmol/L at pre-enrollment); previous diagnosis of hyperthyroidism and failure to correct; Respiratory: pulmonary heart disease; chronic obstructive pulmonary disease; Neuropsychiatric: recent transient ischemic attack or stroke (within the last 3 months); peripheral or severe autonomic dysfunction; mental or nervous system dysfunction, inability to express desire; known drug or alcohol dependence; Malignancy, malnutrition, hematopoietic disorders and other serious diseases.

Entity relations:
- Has_qualifier("medical conditions", "serious")
- Has_value("NYHA class", "III and above")
- Has_qualifier("cardiac dysfunction", "clinically diagnosed")
- Subsumes("cardiac dysfunction", "NYHA class")
- Has_temporal("acute coronary syndrome", "within the last 3 months")
- Has_value("ECG test", "abnormal")
- Has_temporal("ECG test", "pre-enrollment")
- Has_qualifier("atrioventricular block", "grade II")
- Has_qualifier("arrhythmias", "clinically significant")
- Subsumes("arrhythmias", "atrial flutter")
- Has_qualifier("viral hepatitis", "active phase")
- Has_value("liver function test", "abnormal")
- Has_value("ALT", "3 times higher than normal")
- Has_value("ALB", "= 30g/L")
- Has_temporal("liver function test", "pre-enrollment")
- Has_value("serum creatinine", "greater than 200umol/L")
- Has_temporal("serum creatinine", "pre-enrollment")
- Has_qualifier("renal artery stenosis", "clinical diagnosis")
- Has_value("fasting blood glucose", "above 11.1 mmol/L")
- Has_temporal("fasting blood glucose", "at pre-enrollment")
- Has_index("at pre-enrollment", "pre-enrollment")
- Has_qualifier("type 2 diabetes", "uncontrolled")
- Subsumes("type 2 diabetes", "fasting blood glucose")
- Has_context("hyperthyroidism", "failure to correct")
- Has_temporal("hyperthyroidism", "previous")
- Has_temporal("transient ischemic attack", "within the last 3 months")
- Has_qualifier("autonomic dysfunction", "peripheral")
- Subsumes("within the last 3 months", "recent")
- Subsumes("liver function test", "ALB")
- Has_temporal("viral hepatitis", "previous")
- Has_qualifier("valvular heart disease", "clinically significant")
- AND("ECG test", "arrhythmias")
- Subsumes("medical conditions", "cardiac dysfunction")
- OR("grade II", "grade III")
- OR("atrial flutter", "atrial fibrillation", "atrioventricular block")
- OR("ALT", "AST", "GGT", "TBIL", "DBIL")
- OR("transient ischemic attack", "stroke")
- OR("peripheral", "severe")
- OR("cardiac dysfunction", "hypertrophic obstructive cardiomyopathy", "valvular heart disease", "acute coronary syndrome", "percutaneous coronary intervention (PCI)", "coronary artery bypass graft (CABG)", "ECG test")
- OR("arrhythmias", "drug dependence", "Malignancy", "malnutrition", "hematopoietic disorders", "viral hepatitis", "liver function test", "pulmonary heart disease", "chronic obstructive pulmonary disease", "transient ischemic attack", "mental system dysfunction", "nervous system dysfunction", "autonomic dysfunction", "hyperthyroidism", "type 1 diabetes", "type 2 diabetes", "isolated kidney", "kidney transplantation", "renal artery stenosis", "serum creatinine", "gastrointestinal dysfunction", "gastrojejunostomy", "gastrectomy", "inability to express desire", "alcohol dependence")